Clinical trial inclusion criterion:
Patients undergoing small bowel video capsule endoscopy

Annotated entities:
- Procedure: "small bowel video capsule endoscopy"